Clinical trial exclusion criterion:
5. Diagnosis of degenerative cognitive impairment based on clinical and/or neuroradiological findings (i.e., patients with prevailing memory impairment, or with medial temporal atrophy on brain MRI in absence of evident vascular abnormalities; i.e., Alzheimer disease as defined using the National Institute of Neurological and Communicative Disorders and Stroke/Alzheimer's Disease and Related Disorders Association criteria, Parkinson disease, Huntington disease, frontotemporal dementia).

Entity relations:
- AND("medial temporal atrophy", "brain MRI")
- Has_negation("vascular abnormalities", "absence")
- AND("vascular abnormalities", "evident")
- AND("Alzheimer disease", "National Institute of Neurological and Communicative Disorders and Stroke/Alzheimer's Disease and Related Disorders Association criteria")
- AND("memory impairment", "vascular abnormalities")
- AND("memory impairment", "Alzheimer disease")
- AND("degenerative cognitive impairment", "clinical and/or neuroradiological findings")
- Subsumes("clinical and/or neuroradiological findings", "memory impairment")
- OR("Alzheimer disease", "Parkinson disease", "frontotemporal dementia", "Huntington disease")
- OR("memory impairment", "medial temporal atrophy")